Severe pulmonary disease requiring consistent treatment

The above is a clinical trial exclusion criterion. Annotated with entity spans:
[Qualifier: Severe] [Condition: pulmonary disease] [Mood: requiring] [Procedure: consistent treatment]